Fibrates (must be on stable dose for ≥3 months);

The above is a clinical trial exclusion criterion. Annotated with entity spans:
[Drug: Fibrates] (must be on [Qualifier: stable dose] for [Temporal: ≥3 months]);